10. Ability to understand the nature of this study, give written informed consent, and comply with study requirements.

The above is a clinical trial inclusion criterion. Annotated with entity spans:
10. [Post-eligibility: Ability to understand the nature of this study, give written informed consent, and comply with study requirements.]